Subjects who have ever received treatment with biological based therapy example, omalizumab, mepolizumab, for asthma.

The above is a clinical trial exclusion criterion. Annotated with entity spans:
Subjects who have ever received [Procedure: treatment] with biological based therapy example, [Drug: omalizumab], [Drug: mepolizumab], for [Drug: asthma].